Clinical trial exclusion criterion:
3. Total bilirubin > 2 × ULN

Entity relations:
- Has_value("Total bilirubin", "> 2 × ULN")